Respecto a la sedación terminal, señale la respuesta INCORRECTA:
1. Está indicada en pacientes que se encuentran cerca de su fallecimiento.
2. Debe emplearse para aliviar síntomas refractarios a los tratamientos convencionales.
3. No está indicada cuando lo solicita el paciente en situación terminal aduciendo motivos existenciales.
4. Debe emplearse aún si se sospecha que va a ser la responsable de acortar la vida del paciente.

Respuesta correcta: 3. No está indicada cuando lo solicita el paciente en situación terminal aduciendo motivos existenciales.